Clinical trial exclusion criterion:
19. Subject with previous history of tumor, or current tumor patient, or subject with pre-cancerous disease manifested by pathological examination (such as ductal carcinoma in situ or cervical epithelial dysplasia)

Entity relations:
- Has_temporal("tumor", "previous history")
- Has_temporal("tumor", "current")
- AND("pre-cancerous disease", "pathological examination")
- Subsumes("pre-cancerous disease", "ductal carcinoma in situ")
- OR("ductal carcinoma in situ", "cervical epithelial dysplasia")
- OR("tumor", "pre-cancerous disease", "tumor")